Has had a minor surgery ≤7 days prior to the first dose of study medication

The above is a clinical trial exclusion criterion. Annotated with entity spans:
Has had a [Procedure: minor surgery] [Temporal: ≤7 days prior] to the [Reference_point: first dose of study medication]